Active chronic central serous chorioretinopathy (cCSC);

The above is a clinical trial inclusion criterion. Annotated with entity spans:
[Qualifier: Active] [Qualifier: chronic] [Condition: central serous chorioretinopathy (cCSC)];